Clinical trial inclusion criterion:
4. Life expectancy > 3 months

Annotated entities:
- Parsing_Error: "4."
- Observation: "Life expectancy"
- Value: "> 3 months"